Clinical trial exclusion criterion:
any condition that would contra-indicate Magnetic Resonance Imaging or administration of contrast agent

Annotated entities:
- Undefined_semantics: "any condition that would contra-indicate Magnetic Resonance Imaging or administration of contrast agent"